Male or female 18 years or older

The above is a clinical trial inclusion criterion. Annotated with entity spans:
[Person: Male] or [Person: female] [Value: 18 years or older]